屬於延遲性過敏反應的肉芽腫反應（Type Ⅳ granulomatous hypersensitivity）通常需要多久才會產生？
A. 30 分鐘
B. 6-12 小時
C. 48-72 小時
D. 21-28 天

正確答案：D. 21-28 天